Known or suspected alcohol or substance abuse in the preceding 12 months.

The above is a clinical trial exclusion criterion. Annotated with entity spans:
Known or suspected [Condition: alcohol] or [Condition: substance abuse] in the [Temporal: preceding 12 months].